Clinical trial inclusion criterion:
Inclusion criteria includes all U.S. HCA hospitals with an adult ICU;

Annotated entities:
- Visit: "U.S."
- Visit: "HCA hospitals"
- Person: "adult"
- Visit: "adult ICU"